Clinical trial inclusion criterion:
history of gastrectomy,

Annotated entities:
- Temporal: "history"
- Procedure: "gastrectomy"